下列何種藥物不適合用於治療 congestive heart failure 的病人？
A. Losartan
B. Eplerenone
C. Milrinone
D. Aldosterone

正確答案：D. Aldosterone